Clinical trial inclusion criterion:
Unidimensional or bi-dimensional measurable disease

Annotated entities:
- Undefined_semantics: "measurable disease"
- Qualifier: "measurable"
- Subjective_judgement: "measurable"
- Non-query-able: "Unidimensional or bi-dimensional measurable disease"